What is marked by DNaseI hypersensitive sites?

Hypersensitivity of cis-regulatory elements to digestion with DNaseI remains the gold-standard approach to locating such elements.